19. Concomitant administration of any herbal medications

The above is a clinical trial exclusion criterion. Annotated with entity spans:
[Parsing_Error: 19.] [Temporal: Concomitant] administration of any [Drug: herbal medications]